Clinical trial inclusion criterion:
Creatinine clearance more or equal to 30 mL/min

Annotated entities:
- Measurement: "Creatinine clearance"
- Value: "more or equal to 30 mL/min"